Mujer de 72 años con diabetes tipo 2 e insuficiencia renal crónica en estadio 5. Ante la sospecha de un tromboembolismo pulmonar indique qué prueba diagnóstica estaría contraindicada:
1. Ecocardiograma trastorácico.
2. Gammagrafía pulmonar.
3. AngioTC pulmonar.
4. Electrocardiograma.
5. Radiografía de tórax.

Respuesta correcta: 3. AngioTC pulmonar.